Clinical trial exclusion criterion:
Hormonal treatment involving estrogen or progesterone 3 months prior to or during the study period, with the exception of medroxyprogesterone acetate for withdrawal bleeding.

Entity relations:
- AND("medroxyprogesterone acetate", "withdrawal bleeding")
- Has_negation("medroxyprogesterone acetate", "exception")
- OR("3 months prior to the study period", "during the study period")